Clinical trial inclusion criterion:
life expectancy of more than 3 months

Entity relations:
- Has_temporal("life expectancy", "more than 3 months")